Meets DSM-V criteria for current Alcohol Use Disorder

The above is a clinical trial inclusion criterion. Annotated with entity spans:
[Value: Meets] [Measurement: DSM-V criteria] for current [Condition: Alcohol Use Disorder]